Subject are able to complete study procedures, such as spirometry, and Pulmonary Exercise test.

The above is a clinical trial inclusion criterion. Annotated with entity spans:
Subject are able to complete [Procedure: study procedures], such as [Procedure: spirometry], and [Procedure: Pulmonary Exercise test].